Patients able to comply with follow-up requirements including self-evaluations

The above is a clinical trial inclusion criterion. Annotated with entity spans:
P[Post-eligibility: atients able to comply with follow-up requirements including self-evaluations]